Clinical trial exclusion criterion:
8. intent to use NSAIDs or steroids

Entity relations:
- OR("NSAIDs", "steroids")